下列何種頸部裝具對頸部活動度有最佳之固定效果？
A. 暈輪式背心（halo-vest orthrosis）
B. 四式頸椎裝具（four-post orthrosis）
C. 費城頸圈（Philadelphia collar）
D. 邁阿密頸圈（Miami collar）

正確答案：A. 暈輪式背心（halo-vest orthrosis）